Clinical trial exclusion criterion:
patient not previously scheduled for radiofrequency ablation of the cervical, thoracic, or lumbar facets, or sacroiliac joints

Annotated entities:
- Negation: "not"
- Temporal: "previously"
- Mood: "scheduled for"
- Procedure: "radiofrequency ablation"
- Qualifier: "cervical facets"
- Qualifier: "thoracic facets"
- Qualifier: "lumbar facets"
- Qualifier: "sacroiliac joints"